La atmosfera delirante se define como:
1. La interpretación delirante de una percepción normal.
2. Una idea autorreferencial, de gran importancia para el paciente.
3. Experiencia subjetiva de que el mundo ha cambiado de un modo sutil pero siniestro, inquietante y difícil o imposible de definir.
4. La construcción delirante de un recuerdo.
5. Una idea racional y fácilmente modificable sobre un tema ambiental.

Respuesta correcta: 3. Experiencia subjetiva de que el mundo ha cambiado de un modo sutil pero siniestro, inquietante y difícil o imposible de definir.